previous fracture in finger to be treated, which affects range of motion of MP or PIP joint

The above is a clinical trial exclusion criterion. Annotated with entity spans:
[Temporal: previous] [Condition: fracture] in [Qualifier: finger to be treated], which [Condition: affects range of motion] of [Qualifier: MP] or [Qualifier: PIP joint]